下列何者的起始點（origin）不在肱骨？
A. 旋後肌（supinator）
B. 旋前圓肌（pronator teres）
C. 肱肌（brachialis）
D. 肱二頭肌（biceps brachii）

正確答案：D. 肱二頭肌（biceps brachii）